Clinical trial exclusion criterion:
eGFR < 60 ml/min/1,73 m2 (MDRD-formula, confirmed on a second day)

Annotated entities:
- Measurement: "eGFR"
- Value: "< 60 ml/min/1,73 m2"